Clinical trial exclusion criterion:
5. Patient has contraindications to general anesthesia.

Annotated entities:
- Condition: "contraindications to general anesthesia"
- Procedure: "general anesthesia"